Clinical trial exclusion criterion:
Use of antidepressant medications or other psychotropic medications in the last 4 weeks (or the last 6 weeks for fluoxetine). Occasional use of benzodiazepines or non-benzodiazepine sedatives (such as zolpidem, eszopiclone, or zaleplon) during this period is allowable.

Annotated entities:
- Drug: "antidepressant medications"
- Qualifier: "other"
- Drug: "psychotropic medications"
- Temporal: "in the last 4 weeks"
- Temporal: "in the last 6 weeks"
- Drug: "fluoxetine"
- Multiplier: "Occasional use"
- Drug: "benzodiazepines sedatives"
- Drug: "non-benzodiazepine sedatives"
- Drug: "zolpidem"
- Drug: "eszopiclone"
- Drug: "zaleplon"
- Negation: "is allowable"